Clinical trial exclusion criterion:
patients received doxorubicin therapy, total cumulative dose of adriamycin was more than 300 mg/m2, total cumulative dose of epirubicin was more than 450 mg/m2;

Annotated entities:
- Drug: "doxorubicin"
- Drug: "adriamycin"
- Multiplier: "more than 300 mg/m2"
- Qualifier: "total cumulative dose"
- Drug: "epirubicin"
- Qualifier: "total cumulative dose"
- Multiplier: "more than 450 mg/m2"